頸動脈海綿竇瘻管（carotid cavernous fistula）的病人，其結膜可能出現下列何種表徵？
A. 鮭色斑（salmon patch）
B. 卡波西氏肉瘤（Kaposi's sarcoma）
C. 結膜及上鞏膜血管曲張（corkscrew-like vessels）
D. 微小動脈瘤（microaneurysm）

正確答案：C. 結膜及上鞏膜血管曲張（corkscrew-like vessels）